Willing to follow the protocol

The above is a clinical trial inclusion criterion. Annotated with entity spans:
[Post-eligibility: Willing to follow the protocol]